一位7歲男童初步診斷為急性腎衰竭。抽血測得之血中尿素氮（BUN）值為36 mg/dL，血清肌酸酐值 mg/dL。尿液常規中之尿蛋白為陰性，尿液比重為1.002。尿液的鈉離子排出率（fractional excretion of sodium; FENa）大於1%。超音波檢查無腎水腫（hydronephrosis）。下列何者為最可能之診斷？
A. 急性腎小管壞死（acute tubular necrosis）合併腎衰竭
B. 急性腎絲球腎炎（acute glomerulonephritis）合併腎衰竭
C. 低血容（hypovolemia）合併腎衰竭
D. 神經性膀胱（neurogenic bladder）合併腎衰竭

正確答案：A. 急性腎小管壞死（acute tubular necrosis）合併腎衰竭